Active CNS or epiduraltumor

The above is a clinical trial exclusion criterion. Annotated with entity spans:
Active [Condition: CNS] or [Condition: epiduraltumor]